With other hemorrhagic diseases and anticoagulant therapy is not allowed;

The above is a clinical trial exclusion criterion. Annotated with entity spans:
With [Qualifier: other] [Condition: hemorrhagic diseases] and [Procedure: anticoagulant therapy] is [Condition: not allowed];